一位55歲的女性，有肺癌病史。兩天前突然發生背痛，但生命跡象穩定，大小便功能及四肢神經功能正常。 脊椎X光及磁振造影檢查結果疑似第二腰椎轉移性腫瘤，但無明顯神經壓迫。下列敘述何者錯誤？
A. 可以安排骨骼同位素掃描（bone scan）檢查，幫忙診斷是否有其他骨骼部位的轉移
B. 可以安排電腦斷層導引活體組織切片檢查（CT-guided biopsy），幫忙確定是否為腫瘤轉移
C. 若確定是轉移性腫瘤，應建議患者馬上接受脊椎固定、椎板切除神經減壓手術，來治療其背痛及預防神經壓迫受損
D. 轉移性脊椎腫瘤的手術目的，主要是改善患者疼痛及生活品質，對其原發腫瘤的病情控制及存活時間，並

正確答案：C. 若確定是轉移性腫瘤，應建議患者馬上接受脊椎固定、椎板切除神經減壓手術，來治療其背痛及預防神經壓迫受損